SI joint pathology is the predominant source of pain

The above is a clinical trial inclusion criterion. Annotated with entity spans:
[Condition: SI joint pathology] [Non-representable: is the predominant source of pain]